一般而言，廢水三級處理的正常順序為何？
A. 物理、化學、生物
B. 生物、化學、物理
C. 化學、生物、物理
D. 物理、生物、化學

正確答案：D. 物理、生物、化學